下列何種桿菌為不會形成芽孢之革蘭氏陽性桿菌？
A. 炭疽桿菌（Bacillus anthracis）
B. 破傷風桿菌（Clostridium tetani）
C. 紅斑丹毒桿菌（Erysipelothrix rhusiopathiae）
D. 大腸桿菌（Escherichia coli）

正確答案：C. 紅斑丹毒桿菌（Erysipelothrix rhusiopathiae）